What is the alternative lengthening of telomeres?

Alternative lengthening of telomeres (ALT) is a telomerase independent telomere maintenance mechanism that occurs in ∼15% of cancers. It is proposed to occur preferentially at telomeric lagging strands leading to heterogeneous telomere lengths observed in most ALT cancers.